形成含鈣腎結石（calcium nephrolithiasis）最常見的原因有那些？①尿中鈣離子濃度增加 ②尿中尿酸濃度上升 ③尿中草酸鹽（oxalate）濃度上升 ④尿中檸檬酸鹽（citrate）濃度上升
A. ①②③
B. ①②④
C. ②③④
D. ①③④

正確答案：A. ①②③